En el proceso de transducción de la señal olfativa, la proteína de la membrana de las células de la mucosa olfatoria que actúa como receptor de moléculas de odorante está ligada y por lo tanto interacciona inicialmente con:
1. Una proteína quinasa C.
2. Un canal iónico dependiente de ligando.
3. Una proteína G.
4. Una proteína con actividad adenilatociclasa.

Respuesta correcta: 3. Una proteína G.